下列何者不參與瞳孔光反射？
A. pretectal area
B. 外膝狀體（lateral geniculate body）
C. 睫狀神經節（ciliary ganglion）
D. 短睫神經（short ciliary nerve）

正確答案：B. 外膝狀體（lateral geniculate body）